Person is currently fitted with a prosthesis using a non-microprocessor controlled prosthetic knee for at least 6 months.

The above is a clinical trial inclusion criterion. Annotated with entity spans:
Person is currently fitted with a [Device: prosthesis] using a [Qualifier: non-microprocessor controlled] [Device: prosthetic knee] for [Temporal: at least 6 months].